Current Axis I primary psychiatric diagnosis other than major depressive disorder.

The above is a clinical trial exclusion criterion. Annotated with entity spans:
Current [Qualifier: Axis I] [Qualifier: primary] [Condition: psychiatric diagnosis] [Negation: other than] [Condition: major depressive disorder].